Preexisting systemic diseases or conditions that may confound the results of the study;

The above is a clinical trial exclusion criterion. Annotated with entity spans:
[Temporal: Preexisting] [Condition: systemic diseases] or [Condition: conditions] that [Qualifier: may confound the results of the study];